Clinical trial inclusion criterion:
Patients scheduled for thyroidectomy with general anesthesia in the University of Chile Clinical Hospital

Entity relations:
- AND("thyroidectomy", "general anesthesia")
- Has_mood("thyroidectomy", "scheduled for")
- AND("thyroidectomy", "University of Chile Clinical Hospita")